Death imminent

The above is a clinical trial exclusion criterion. Annotated with entity spans:
[Condition: Death] [Temporal: imminent]